Clinical trial inclusion criterion:
Male

Annotated entities:
- Person: "Male"